Clinical trial inclusion criterion:
At least one site of measurable disease on CT/MRI scans as defined by RECIST 1.1. Baseline imaging must be performed within 30 days of dosing.

Annotated entities:
- Condition: "measurable disease"
- Procedure: "CT scans"
- Procedure: "MRI scans"
- Procedure: "imaging"
- Temporal: "Baseline"
- Temporal: "within 30 days of dosing"
- Reference_point: "dosing"